Clinical trial inclusion criterion:
willing to modify antiretroviral therapy, in accordance with the randomisation assignment

Annotated entities:
- Procedure: "antiretroviral therapy"
- Observation: "willing"